24 歲在電子工廠工作的李先生有用禁藥的紀錄，因左邊癱瘓住院；他有可能使用下列那種管制藥物或禁藥導致中風？
A. Demerol
B. Cocaine
C. Valium
D. Marijuana

正確答案：B. Cocaine